Clinical trial inclusion criterion:
ASA classification II or III females

Annotated entities:
- Measurement: "ASA classification"
- Value: "II or III"
- Person: "females"